pelvic pain

The above is a clinical trial inclusion criterion. Annotated with entity spans:
[Condition: pelvic pain]